Clinical trial exclusion criteria:
aged less than 20 years
history of gastric resection surgery
history of allergy to study drugs
pregnancy or lactating women
severe underlying illness, such as end stage renal disease, decompensated liver cirrhosis, or non-curative malignancy

Annotated entities:
- Person: "aged"
- Value: "less than 20 years"
- Procedure: "gastric resection surgery"
- Condition: "allergy"
- Drug: "study drugs"
- Condition: "pregnancy"
- Condition: "lactating"
- Person: "women"
- Condition: "severe underlying illness"
- Condition: "end stage renal disease"
- Condition: "liver cirrhosis"
- Qualifier: "decompensated"
- Condition: "malignancy"
- Qualifier: "non-curative"